Written maternal informed consent

The above is a clinical trial inclusion criterion. Annotated with entity spans:
[Post-eligibility: Written maternal informed consent]